History of chronic obstructive pulmonary disease or cor pulmonale, or substantially decreased respiratory reserve, hypoxia, hypercapnia or pre-existing respiratory depression

The above is a clinical trial exclusion criterion. Annotated with entity spans:
History of [Condition: chronic obstructive pulmonary disease] or [Condition: cor pulmonale,] or substantially [Condition: decreased respiratory reserve], [Condition: hypoxia], [Condition: hypercapnia] or pre-existing [Condition: respiratory depression]